Clinical trial inclusion criterion:
Patient is able and willing to sign the Informed Consent Form.

Annotated entities:
- Post-eligibility: "Patient is able and willing to sign the Informed Consent Form"